HCC or other malignancy within 3 years.

The above is a clinical trial exclusion criterion. Annotated with entity spans:
[Condition: HCC] or other [Condition: malignancy] [Temporal: within 3 years].